Clinical trial inclusion criterion:
full term

Annotated entities:
- Condition: "full term"